Clinical trial exclusion criterion:
Hepatic or renal disease

Entity relations:
- OR("Hepatic disease", "renal disease")